Clinical trial inclusion criterion:
HBsAg positive at baseline

Entity relations:
- Has_temporal("HBsAg positive", "at baseline")